Clinical trial exclusion criteria:
History of spinal cord stenosis or clinical symptoms of lumbar radiculopathy;
History or onset neurological diseases;
Generalized pain or fibromyalgia;
Inability to walk;
History of knee surgery in the target knee;
Secondary causes of osteoarthritis;
Use of statins and quinolones in the previous year;
Uncontrolled and ongoing psychiatric diseases;
Invasive knee treatments with hyaluronic acid infusion, corticosteroids and anaesthetics, in the target knee, up to 6 months previous to study inclusion.

Annotated entities:
- Condition: "spinal cord stenosis"
- Temporal: "History"
- Condition: "lumbar radiculopathy"
- Condition: "clinical symptoms"
- Condition: "neurological diseases"
- Temporal: "History"
- Temporal: "onset"
- Condition: "Generalized pain"
- Condition: "fibromyalgia"
- Condition: "Inability to walk"
- Procedure: "knee surgery"
- Reference_point: "target knee"
- Temporal: "History"
- Condition: "osteoarthritis"
- Condition: "Secondary causes"
- Undefined_semantics: "Secondary causes of osteoarthritis"
- Drug: "statins"
- Drug: "quinolones"
- Temporal: "in the previous year"
- Condition: "psychiatric diseases"
- Temporal: "ongoing"
- Qualifier: "Uncontrolled"
- Procedure: "Invasive knee treatments"
- Drug: "hyaluronic acid"
- Procedure: "hyaluronic acid infusion"
- Drug: "corticosteroids"
- Drug: "anaesthetics"
- Reference_point: "target knee"
- Temporal: "up to 6 months previous"
- Reference_point: "study inclusion"